El embarazo ectópico más habitual se produce en:
1. La trompa de Falopio.
2. El tubo oviductal.
3. El cuello uterino.
4. El ovario.
5. El abdomen.

Respuesta correcta: 1. La trompa de Falopio.